Haematological disorders (Anaemia, malignancy, bleeding disorders)

The above is a clinical trial exclusion criterion. Annotated with entity spans:
[Condition: Haematological disorders] ([Condition: Anaemia], [Condition: malignancy], [Condition: bleeding disorders])